Clinical trial inclusion criterion:
disease duration of at least 5 years.

Annotated entities:
- Measurement: "disease duration"
- Value: "at least 5 years"